Clinical trial inclusion criterion:
At the discretion of the operating surgeon, ANC>1000/mcl and platelets>100,000/mcl.

Entity relations:
- Has_value("ANC", ">1000/mcl")
- Has_value("platelets", ">100,000/mcl")